Being pregnant or plan on immediately becoming pregnant

The above is a clinical trial exclusion criterion. Annotated with entity spans:
Being [Condition: pregnant] or [Mood: plan on immediately becoming] [Condition: pregnant]